Clinical trial inclusion criterion:
1. Mean pulmonary arterial pressure ≥25 mmHg (at rest) and

Annotated entities:
- Parsing_Error: "1."
- Measurement: "Mean pulmonary arterial pressure"
- Value: "≥25 mmHg"
- Qualifier: "at rest"